60歲男性病患於右側頸部上緣腫塊處接受細針抽取細胞學檢查，結果顯示為轉移性	狀上皮細胞癌（metastatic squamous cell carcinoma）。接下去為病患優先安排的檢查最適宜的是：
A. 耳鼻喉局部檢查
B. 胃鏡檢查
C. 胸部電腦斷層檢查
D. 腹部超音波檢查

正確答案：A. 耳鼻喉局部檢查